Clinical trial inclusion criterion:
Fasting LDL-C = 250mg/dL at the screening visit

Entity relations:
- Has_value("Fasting LDL-C", "= 250mg/dL")
- Has_temporal("Fasting LDL-C", "at the screening visit")